Clinical trial exclusion criterion:
12. Other serious illnesses (e.g., serious infections requiring antibiotics, bleeding disorders).

Entity relations:
- Has_qualifier("infections requiring antibiotics", "serious")
- Has_qualifier("illnesses", "serious")
- AND("illnesses", "infections requiring antibiotics")
- OR("infections requiring antibiotics", "bleeding disorders")